To which disease does the loss of CD28 expression by liver-infiltrating T cells contribute?

Loss of CD28 expression by liver-infiltrating T cells contributes to pathogenesis of primary sclerosing cholangitis.